Patients undergoing small bowel video capsule endoscopy

The above is a clinical trial inclusion criterion. Annotated with entity spans:
Patients undergoing [Procedure: small bowel video capsule endoscopy]